Malignant neoplasm requiring chemotherapy, surgery, radiation or palliative therapy in the previous 5 years. Patients with intraepithelial squamous cell carcinoma of the skin treated with topical 5FU and subjects with basal cell skin cancer are allowed to enter the trial.

The above is a clinical trial exclusion criterion. Annotated with entity spans:
[Condition: Malignant neoplasm] requiring [Procedure: chemotherapy], [Procedure: surgery], [Procedure: radiation] or [Procedure: palliative therapy] in the [Temporal: previous 5 years.] Patients with [Condition: intraepithelial squamous cell carcinoma] of the [Qualifier: skin] treated with [Drug: topical 5FU] and subjects with [Condition: basal cell skin cancer] are [Negation: allowed] to enter the trial.